80 歲陳先生，患有高血壓、糖尿病、攝護腺肥大症多年，規則於醫院就診，總共服用 6 種不同頻率之藥物。也常因感冒、頭暈、倦怠或水腫等不舒服症狀至診所就醫，而自行停用原本服用之慢性病藥物。下列有關老人用藥原則，何者正確？
A. 此個案停用原本服用之慢性病治療藥物是正確的，因為容易有藥物交互作用
B. 此個案服藥時間、次數不需整合
C. 此個案無多重藥物問題
D. 此個案頭暈、倦怠或水腫等症狀，可能與長期使用藥物有關

正確答案：D. 此個案頭暈、倦怠或水腫等症狀，可能與長期使用藥物有關